List signs of patients with biallelic variants in KARS1

Biallelic variants in KARS1 are associated with neurodevelopmental disorders and hearing loss recapitulated in the knockout zebrafish.